Patients with acute gastrointestinal bleeding

The above is a clinical trial exclusion criterion. Annotated with entity spans:
Patients with [Qualifier: acute] [Condition: gastrointestinal bleeding]